Clinical trial inclusion criterion:
Left ventricular ejection fraction > 25%

Entity relations:
- Has_value("Left ventricular ejection fraction", "> 25%")